Acude a una consulta de enfermería un joven de 18 años de edad con una herida de mordedura de perro en la cara lateral del miembro inferior derecho. La herida se produjo hace 30 horas y afecta a tejido subcutáneo, tiene forma de luna (unos 5 cm aproximadamente de largo) y es profunda. Teniendo en cuenta que tiene el calendario vacunal infantil completo, ¿qué intervención estaría indicada en relación a la vacunación del tétanos?
1. No requiere ninguna intervención.
2. Poner dosis de recuerdo de la vacuna de tétanos (dTe).
3. Administración de gammaglobulina antitetánica (GGAT).
4. Administración de gammaglobulina antitetánica y dosis de recuerdo de vacuna del tétanos.
5. Administración de gammaglobulina antitetánica y reiniciar vacunación del tétanos.

Respuesta correcta: 1. No requiere ninguna intervención.